Clinical trial inclusion criterion:
All subjects will speak English as their first language or demonstrate proficiency in English (defined as reaching a scaled score of > 11 on the WAIS vocabulary test).

Annotated entities:
- Observation: "speak English"
- Qualifier: "first language"
- Observation: "proficiency in English"
- Measurement: "WAIS vocabulary test"
- Value: "> 11"